有關免疫抑制藥物何者可螯合細胞內 DNA 以達到抑制免疫淋巴細胞增生與相關免疫反應？
A. Cyclosporine
B. Tacrolimus
C. Cyclophosphamide
D. Muromonab-CD3

正確答案：C. Cyclophosphamide